Clinical trial exclusion criterion:
History of liver cirrhosis, chronic kidney disease, malignancy, inflammatory bowel disease, significant infectious disease, polyposis syndrome

Annotated entities:
- Condition: "liver cirrhosis"
- Condition: "chronic kidney disease"
- Condition: "malignancy"
- Condition: "inflammatory bowel disease"
- Condition: "significant infectious disease"
- Condition: "polyposis syndrome"
- Temporal: "History"